一位 55 歲罹患肝癌合併腹腔內轉移的患者，目前正在接受一種試驗性的化學治療，而你是他的住院醫師。有一天，患者請你坐在他的床邊，想問你一些問題。他說他覺得那種藥沒有甚麼效果，但又不敢向主治醫師要求停止用藥。下列何者為最適當的第一個回應？
A. 先聆聽他的感受和想法，了解他的關切再談後續的處置
B. 建議病患儘量配合用藥，以爭取最大的存活機會
C. 答應替他尋找最新資料再確認是否值得繼續用藥
D. 告知患者你並不了解他使用中的藥物，請他與主治醫師討論

正確答案：A. 先聆聽他的感受和想法，了解他的關切再談後續的處置